List clinical phenotypes and molecular genetic features of patients with KMT2B-related disorders

KMT2B-related disorders result in significant improvement in motor function and disability at 6 months, 1 year, and again at 1 year after stimulation. The greatest improvements are seen for trunk and cervical dystonia, with less clinical impact on laryngeal or transternal dystonias. Patients with chromosomal deletions and protein truncating variants have a higher burden of systemic disease than those with missense variants.